Clinical trial exclusion criterion:
History of fainting or other significant adverse reaction during phlebotomy or donation of blood

Entity relations:
- AND("adverse reaction", "phlebotomy")
- OR("phlebotomy", "donation of blood")
- OR("fainting", "adverse reaction")